Clinical trial exclusion criterion:
Any contraindication to allergy testing will also result in exclusion

Entity relations:
- AND("contraindication", "allergy testing")